Clinical trial exclusion criterion:
congenital or acquired bleeding tendency

Entity relations:
- Has_qualifier("bleeding tendency", "congenital")
- OR("congenital", "acquired")